Psychiatric illness

The above is a clinical trial inclusion criterion. Annotated with entity spans:
[Condition: Psychiatric illness]